Clinical trial exclusion criterion:
Allergy to local anesthetics

Annotated entities:
- Condition: "Allergy"
- Drug: "local anesthetics"